Clinical trial exclusion criterion:
Steroids other than methylprednisolone or prednisone

Annotated entities:
- Drug: "methylprednisolone"
- Drug: "prednisone"
- Drug: "Steroids"
- Negation: "other than"